Clinical trial exclusion criterion:
AST or ALT >2 x upper limit of normal (ULN)

Entity relations:
- Has_value("AST", ">2 x upper limit of normal (ULN)")
- OR("AST", "ALT")